Contraindications to dapagliflozin according to the local label.

The above is a clinical trial exclusion criterion. Annotated with entity spans:
[Condition: Contraindications] to [Drug: dapagliflozin] according to the local label.